下列那些肌肉與肋骨連結且與呼吸有關？
A. 斜方肌（trapezius）、闊背肌（latissimus dorsi）
B. 大菱形肌（rhomboideus major）、提肩胛肌（levator scapulae）
C. 上後鋸肌（serratus posterior superior）、下後鋸肌（serratus posterior inferior）
D. 頭夾肌（splenius capitis）、頸夾肌（splenius cervicis）

正確答案：C. 上後鋸肌（serratus posterior superior）、下後鋸肌（serratus posterior inferior）